Which is the most widely used anti-TNF drug?

Etanercept is the most widely used anti-TNF drug.